下列有關高度近視造成之視網膜病變的敘述，何者錯誤？
A. 視網膜後極部漆裂紋（lacquer cracks）
B. 視網膜後極部葡萄腫（staphyloma）
C. 周邊視網膜格子狀變性（lattice degeneration）
D. 視網膜色素上皮肥厚（hypertrophy of the retinal pigment epithelium）

正確答案：D. 視網膜色素上皮肥厚（hypertrophy of the retinal pigment epithelium）